Clinical trial exclusion criterion:
Subjects were not to have had treatment with any known enzyme-altering agents (barbiturates, phenothiazines, cimetidine etc.) within 30 days prior to or during the study.

Entity relations:
- OR("barbiturates", "phenothiazines", "cimetidine")